Clinical trial inclusion criterion:
Age 65 - 79

Annotated entities:
- Person: "Age"
- Value: "65 - 79"